Clinical trial exclusion criteria:
PCOS patients
Allergy to gonadotrophins
Concomitant participation in other trial

Annotated entities:
- Condition: "PCOS"
- Drug: "gonadotrophins"
- Condition: "Allergy"
- Competing_trial: "Concomitant participation in other trial"